Which gene is responsible for proper speech development?

The Key Regulator for Language and Speech Development, FOXP2, is a Novel Substrate for SUMOylation. Transcription factor forkhead box protein P2 (FOXP2) plays an essential role in the development of language and speech.